一位 54 歲女性發現子宮內有一個 10 公分的腫瘤，隨後病人接受了全子宮切除術。巨觀下這個子宮的腫瘤呈現紅棕色，顯微鏡下看到細胞密度很高的紡錘形腫瘤細胞，細胞核十分濃染，每個高倍鏡視野下都可以看到約 10～20 個有絲分裂。則最有可能的診斷是什麼？
A. 子宮內膜息肉（endometrial polyp）
B. 子宮腺肌症（adenomyosis）
C. 平滑肌肉瘤（leiomyosarcoma）
D. 平滑肌瘤（leiomyoma）

正確答案：C. 平滑肌肉瘤（leiomyosarcoma）